LV ejection fraction = 50

The above is a clinical trial inclusion criterion. Annotated with entity spans:
[Measurement: LV ejection fraction] [Value: = 50]